Clinical trial exclusion criterion:
If female of childbearing potential: known pregnancy, or unwilling to practice anticontraceptive measures.

Annotated entities:
- Pregnancy_considerations: "f female of childbearing potential: known pregnancy, or unwilling to practice anticontraceptive measures"